根據衛生福利部定義我國成人肥胖的BMI（Body Mass Index）切點為何？
A. 25
B. 27
C. 29
D. 31

正確答案：B. 27